Clinical trial exclusion criterion:
Thyroid disease with thyroid function poorly controlled on prescribed medications. Patients with abnormal thyroid stimulating hormone or T4 concentrations, with elevation of antibodies to thyroid peroxidase and any clinical manifestations of thyroid disease are excluded.

Entity relations:
- Has_value("thyroid function", "poorly controlled")
- AND("Thyroid disease", "thyroid function")
- Has_qualifier("thyroid function", "on prescribed medications")
- Has_value("thyroid stimulating hormone", "abnormal")
- Has_value("antibodies to thyroid peroxidase", "elevation")
- OR("thyroid stimulating hormone", "T4 concentrations")
- OR("thyroid stimulating hormone", "clinical manifestations of thyroid disease", "antibodies to thyroid peroxidase")